Clinical trial inclusion criterion:
history of significant bleeding (i.e. bleeding which required intervention or hospitalization), even in the absence of anticoagulation treatment at the time of the bleeding event, or

Entity relations:
- Has_qualifier("bleeding", "significant")
- AND("bleeding", "intervention")
- Subsumes("bleeding", "bleeding")
- OR("intervention", "hospitalization")